Clinical trial inclusion criteria:
Diagnosis of idiopathic Parkinson's disease that is optimally treated (motor fluctuations <20% of subject's awake time). Subjects may be on levodopa therapy but must be stable at the time of entry into the study
Sexually active (i.e. =1 attempt/week) males, 40 - 64 years of age (inclusive) at time of screening
Diagnosis of moderate erectile dysfunction (defined according to the NIH Consensus Development Panel on Impotence) for more than 6 months and demonstrating and incomplete response to tadalafil alone
Subject demonstrating an IIEF-5 drug-free baseline score that is = 10 but = 16, and an IIEF-5 tadalafil-alone baseline score that is = 18
Subject in a stable heterosexual relationship for at least 6 months. (2)
Subject motivated to seek treatment for erectile dysfunction.
Subject with a total serum testosterone level = 300 ng/dL, with or without supplementation
Hoehn and Yahr Scale score of 1 - 3
Patient able to consent and comply with protocol requirements

Annotated entities:
- Condition: "idiopathic Parkinson's disease"
- Qualifier: "treated"
- Measurement: "motor fluctuations"
- Value: "<20% of subject's awake time"
- Observation: "Sexually active"
- Person: "males"
- Person: "age"
- Value: "40 - 64 years"
- Multiplier: "=1 attempt/week"
- Condition: "erectile dysfunction"
- Qualifier: "moderate"
- Temporal: "for more than 6 months"
- Drug: "tadalafil"
- Condition: "response"
- Qualifier: "incomplete"
- Measurement: "IIEF-5 drug-free baseline score"
- Value: "= 10 but = 16"
- Measurement: "IIEF-5 tadalafil-alone baseline score"
- Value: "= 18"
- Observation: "heterosexual relationship"
- Qualifier: "stable"
- Temporal: "at least 6 months"
- Condition: "erectile dysfunction"
- Procedure: "treatment"
- Post-eligibility: "Subject motivated to seek treatment for erectile dysfunction"
- Measurement: "total serum testosterone level"
- Value: "= 300 ng/dL"
- Measurement: "Hoehn and Yahr Scale score"
- Value: "1 - 3"
- Informed_consent: "Patient able to consent and comply with protocol requirements"